Clinical trial inclusion criterion:
Age between 20 and 40 years

Annotated entities:
- Person: "Age"
- Value: "between 20 and 40 years"